Clinical trial inclusion criteria:
treatment-naive patients with B-cell lymphoma
HBsAg positive at baseline
treated with rituximab-based immunochemotherapy
life expectancy of more than 3 months

Annotated entities:
- Condition: "treatment"
- Condition: "B-cell lymphoma"
- Negation: "naive"
- Condition: "HBsAg positive"
- Temporal: "at baseline"
- Qualifier: "rituximab-based"
- Drug: "rituximab"
- Procedure: "immunochemotherapy"
- Observation: "life expectancy"
- Value: "more than 3 months"